Clinical trial inclusion criterion:
diagnosed with stable chronic heart failure NYHA class II-III

Annotated entities:
- Qualifier: "stable"
- Condition: "chronic heart failure"
- Measurement: "NYHA class"
- Value: "II-III"